Clinical trial exclusion criterion:
Previous participation in an HIV vaccine trial. Participants that were documented to have received only placebo are not excluded.

Annotated entities:
- Observation: "HIV vaccine trial"
- Person: "participation"
- Temporal: "Previous"
- Person: "Participants"
- Procedure: "placebo"
- Mood: "not"